Clinical trial exclusion criterion:
History of documented clotting/coagulation disorder

Entity relations:
- OR("clotting disorder", "coagulation disorder")